Clinical trial inclusion criterion:
A MoCA score between 19 and 28 (inclusive) at screening. For those on cognitive enhancers (donepezil, rivastigmine, memantine, galantamine) a MoCA score between 19 and 29 (inclusive) at screening.

Entity relations:
- Has_value("MoCA score", "between 19 and 28")
- Has_value("MoCA score", "between 19 and 29")
- Subsumes("cognitive enhancers", "donepezil")
- OR("donepezil", "rivastigmine", "memantine", "galantamine")
- OR("MoCA score", "cognitive enhancers")